Adequate organ function within 14 days of dosing

The above is a clinical trial inclusion criterion. Annotated with entity spans:
[Condition: Adequate organ function] [Temporal: within 14 days of dosing]